28歲的開放性肺結核女性病人，接受含有isoniazid, rifampin, ethambutol及pyrazinamide的抗結核藥物治療，在治療3個星期後，發生嚴重痛風。最有可能導致其痛風發作的藥物為何？
A. isoniazid
B. rifampin
C. ethambutol
D. pyrazinamide

正確答案：D. pyrazinamide